Clinical trial inclusion criterion:
Meets the Diagnostic and Statistical Manual (DSM) IV and DSM-V diagnostic criteria for generalised anxiety disorder (GAD) based on structured interview (Mini International Neuropsychiatric Interview-Plus 6 [MINI-Plus 6]. Note that while the MINI-Plus 6 uses the DSM-IV criteria, the same criteria are used in the DSM-V).

Entity relations:
- Subsumes("generalised anxiety disorder", "GAD")
- Subsumes("structured interview", "Mini International Neuropsychiatric Interview-Plus 6 [MINI-Plus 6]")
- AND("structured interview", "Diagnostic and Statistical Manual (DSM) IV and DSM-V diagnostic criteria")
- AND("generalised anxiety disorder", "structured interview")